has ever taken Xyrem / sodium oxybate / GHB at any time

The above is a clinical trial exclusion criterion. Annotated with entity spans:
has [Temporal: ever] taken [Drug: Xyrem] / [Drug: sodium oxybate] / [Drug: GHB] at any time